Clinical trial inclusion criterion:
Age=18 years and =80 years;

Entity relations:
- Has_value("Age", "=18 years and =80 years")